Clinical trial exclusion criterion:
Patients with psychiatric disorders that would interfere with consent or follow-up. Pregnant or lactating women. Men and women of reproductive potential may not participate unless they have agreed to use an effective contraceptive method.

Entity relations:
- Has_qualifier("psychiatric disorders", "interfere with follow-up")
- AND("reproductive potential", "effective contraceptive method")
- OR("interfere with consent", "interfere with follow-up")
- OR("Pregnant", "lactating")